單純性肺動脈瓣狹窄（pulmonary atresia with intact ventricular septum）的病人，若右心室漏斗部 （infundibulum）缺損，同時冠狀動脈與右心室腔有相通，則第一階段的手術以那一種最適宜？
A. 肺動脈瓣切開術
B. Blalock-Taussig 分流術
C. 肺動脈瓣切開，合併 Blalock-Taussig 分流術
D. 在體外循環下，做越過環部的布塊狀肺動脈瓣（transannular patching）

正確答案：B. Blalock-Taussig 分流術